Clinical trial inclusion criterion:
normal liver and kidney function

Annotated entities:
- Condition: "normal kidney function"
- Condition: "normal liver function"